Clinical trial inclusion criterion:
10. Ability to comply with study procedures for the entire length of the study

Annotated entities:
- Non-query-able: "Ability to comply with study procedures for the entire length of the study"
- Post-eligibility: "Ability to comply with study procedures for the entire length of the study"